在乳癌診治中，腋下淋巴腺分為三區（level），其中第二區（level Ⅱ）是：
A. 位於胸背動脈（thoracodorsal artery）之外側
B. 位於胸背動脈之內側
C. 又稱為腋尖淋巴結（apical node）
D. 位於小胸肌（pectoralis minor muscle）之後方

正確答案：D. 位於小胸肌（pectoralis minor muscle）之後方